currently on buprenorphine maintenance therapy

The above is a clinical trial inclusion criterion. Annotated with entity spans:
[Temporal: currently] on [Procedure: buprenorphine maintenance therapy]